Clinical trial exclusion criterion:
Use of intravenous amiodarone or lidocaine in the last 24 hours

Annotated entities:
- Qualifier: "intravenous"
- Drug: "amiodarone"
- Drug: "lidocaine"
- Temporal: "in the last 24 hours"